Clinical trial exclusion criterion:
Patients with eyebrow tatoos

Annotated entities:
- Observation: "eyebrow tatoos"